Clinical trial inclusion criterion:
Signed consent, and when age appropriate, signed assent

Annotated entities:
- Post-eligibility: "Signed consent, and when age appropriate, signed assent"